Clinical trial inclusion criterion:
Ability of perform a maximal exercise test as defined by a respiratory exchange ratio (RER) greater than 1.0 at the time of maximal exercise

Annotated entities:
- Observation: "Ability of perform"
- Procedure: "maximal exercise test"
- Measurement: "respiratory exchange ratio (RER)"
- Value: "greater than 1.0"
- Qualifier: "at the time of maximal exercise"